¿Qué le sugiere, en un recién nacido, la triada de signos “coriorretinitis, calcificaciones cerebrales e hidrocefalia”?:
1. Amebiasis cerebral.
2. Queratitis por Acanthamoeba.
3. Toxoplasmosis.
4. Cisticercosis.

Respuesta correcta: 3. Toxoplasmosis.